7. Use of oral contraceptives in the preceding 2 weeks. Use of Depo-Provera® in the preceding 10 months.

The above is a clinical trial exclusion criterion. Annotated with entity spans:
[Parsing_Error: 7.] Use of [Drug: oral contraceptives] [Temporal: in the preceding 2 weeks]. Use of [Drug: Depo-Provera®] [Temporal: in the preceding 10 months].